not intending to move away from the clinic's catchment area for the next 2 years

The above is a clinical trial inclusion criterion. Annotated with entity spans:
[Non-query-able: not intending to move away from the clinic's catchment area for the next 2 years]